Clinical trial exclusion criterion:
8. Pap smear result at screening that requires cryotherapy, biopsy, treatment (other than for infection), or further evaluation

Entity relations:
- Has_value("Pap smear", "requires cryotherapy")
- Has_temporal("Pap smear", "at screening")
- multi("requires cryotherapy", "cryotherapy")
- multi("requires biopsy", "biopsy")
- multi("requires treatment", "treatment")
- multi("requires further evaluation", "further evaluation")
- OR("requires cryotherapy", "requires biopsy", "requires treatment", "requires further evaluation")